如果孕婦的血型是 AB 型 Rh 陰性，而胎兒的血型是 B 型 Rh 陽性，關於這個懷孕的健康風險，下列何者正確？
A. 胎兒的不同血型血球會攻擊母體，造成母親的自體免疫疾病
B. 如果母親第一次懷孕，本次懷孕胎兒受到母體免疫系統攻擊的機會增加
C. 如果母親之前懷過與本次懷孕同血型的胎兒，本次懷孕胎兒受到母體免疫系統攻擊的機會增加
D. 胎兒產生的抗體在懷孕末期會經過胎盤攻擊母體細胞

正確答案：C. 如果母親之前懷過與本次懷孕同血型的胎兒，本次懷孕胎兒受到母體免疫系統攻擊的機會增加